Acude a la consulta de un centro de salud un chico de 17 años refiriendo fiebre de 39ºC de 48 h de evolución con dolor de garganta. El médico de familia consulta la historia del paciente donde no costa ninguna enfermedad previa. El paciente no refiere tos y a la exploración realizada por su médico de familia revela presencia de exudado amigdalar blanquecino bilateral y adenopatías cervicales anteriores aumentadas de tamaño y dolorosas a la palpación. ¿Cuál sería el tratamiento de elección de este paciente?
1. Penicilina V o amoxicilina.
2. Amoxicilina/Clavulánico.
3. Doxiclina.
4. Ciprofloxacino.
5. Metronizadol.

Respuesta correcta: 1. Penicilina V o amoxicilina.